Clinical trial exclusion criterion:
Over the age of 80

Annotated entities:
- Value: "Over 80"
- Person: "age"